Patient under legal guardianship

The above is a clinical trial exclusion criterion. Annotated with entity spans:
[Non-query-able: Patient under legal guardianship]